Serum creatinine, ≤ 1.5x Institutional Upper Limit of Normal (ULN), or Creatinine Clearance ≥ 50 mL/min (by Cockcroft-Gault formula)

The above is a clinical trial inclusion criterion. Annotated with entity spans:
[Measurement: Serum creatinine], [Value: ≤ 1.5x Institutional Upper Limit of Normal (ULN)], or [Measurement: Creatinine Clearance] [Value: ≥ 50 mL/min] (by [Qualifier: Cockcroft-Gault formula])